A clinical diagnosis of influenza within the previous 12 months

The above is a clinical trial exclusion criterion. Annotated with entity spans:
A clinical diagnosis of [Condition: influenza] [Temporal: within the previous 12 months]